Clinical trial exclusion criterion:
1. Prior exposure to doxorubicin, PLD or any other anthracycline, motolimod and other TLR agonists, MEDI4736 or checkpoint inhibitors, such as anti-CTLA4 and anti-PD1/anti-PD-L1 antibodies.

Annotated entities:
- Parsing_Error: "1."
- Drug: "doxorubicin"
- Drug: "PLD"
- Drug: "anthracycline"
- Drug: "motolimod"
- Drug: "TLR agonists"
- Drug: "MEDI4736"
- Drug: "checkpoint inhibitors"
- Drug: "anti-CTLA4"
- Drug: "anti-PD1 antibodies"
- Drug: "anti-PD-L1 antibodies"
- Grammar_Error: "and"
- Temporal: "Prior"